Clinical trial exclusion criterion:
9. Subjects with clinical symptoms or signs of gastrointestinal obstruction and/or who require drainage gastrostomy tube and/or parenteral hydration or nutrition.

Annotated entities:
- Parsing_Error: "9."
- Condition: "clinical symptoms of gastrointestinal obstruction"
- Condition: "signs of gastrointestinal obstruction"
- Device: "drainage gastrostomy tube"
- Procedure: "parenteral hydration"
- Procedure: "parenteral nutrition"